Clinical trial exclusion criterion:
Lack of informed consent signed,

Annotated entities:
- Negation: "Lack of"
- Observation: "informed consent signed"